腸內菌屬（Enterobacteriaceae）的 Lipopolysaccharide（LPS）分子中那一個部分的變異最大，可以用來區別同一種（species）菌種不同的血清型分類（serotype）？
A. Lipid A
B. Core polysaccharide
C. O antigen
D. 整體結構

正確答案：C. O antigen